Clinical trial exclusion criterion:
1) pregnancy, breast-feeding women, or female patients of childbearing potential but did not take contraceptive measures;2) existing severe acute infection and is not controlled; or purulent and chronic infection, delayed healing wounds; 3) the original severe heart disease, including congestive heart failure, uncontrolled high-risk arrhythmias, unstable angina, myocardial infarction, severe heart valve disease and resistant hypertension; 4) suffering from neurological and psychiatric diseases or mental disorders is not easy to control, poor compliance, and can not be described with treatment responders; primary brain or central nervous metastasis disease has not been controlled, with significant cranial hypertension or neuropsychiatric symptoms; 5) have bleeding tendencies; 6) other researchers believe that patients should not participate in the present trial.

Entity relations:
- Has_qualifier("infection", "acute")
- Has_qualifier("infection", "severe")
- Has_qualifier("infection", "not controlled")
- Has_qualifier("infection", "chronic")
- Has_qualifier("infection", "purulent")
- Has_qualifier("heart disease", "severe")
- Has_qualifier("arrhythmias", "high-risk")
- Has_qualifier("arrhythmias", "uncontrolled")
- Has_qualifier("hypertension", "resistant")
- Has_qualifier("heart valve disease", "severe")
- Subsumes("heart disease", "congestive heart failure")
- Has_negation("controlled", "not")
- Has_qualifier("primary brain disease", "controlled")
- Has_qualifier("cranial hypertension", "significant")
- OR("infection", "infection")
- OR("congestive heart failure", "heart valve disease", "myocardial infarction", "unstable angina", "arrhythmias", "hypertension")
- OR("primary brain disease", "central nervous metastasis disease")
- OR("cranial hypertension", "neuropsychiatric symptoms")
- OR("neurological diseases", "poor compliance", "mental disorders", "psychiatric diseases", "cranial hypertension", "primary brain disease")